Clinical trial exclusion criteria:
Having significant medical illnesses that would interfere with the conduct of the study
Clinically significant abnormal laboratory finding
Having comorbid psychiatric conditions according to the criteria set forth in the DSM-IV(administered by the Mini-International Neuropsychiatric Interview (MINI))
The current OCD symptoms are too severe that the patient cannot finish the evaluation or receive the ERP
Being currently at risk for suicide
Being pregnant or having the intention to be pregnant before the end of the study
A history of having inadequate response to adequate SSRIs or CBT treatment
Subjects who are unable to undergo the MRI

Annotated entities:
- Non-query-able: "Having significant medical illnesses that would interfere with the conduct of the study"
- Non-query-able: "Clinically significant abnormal laboratory finding"
- Condition: "psychiatric conditions"
- Qualifier: "comorbid"
- Qualifier: "DSM-IV"
- Condition: "OCD symptoms"
- Qualifier: "severe"
- Observation: "risk for suicide"
- Pregnancy_considerations: "Being pregnant or having the intention to be pregnant before the end of the study"
- Drug: "SSRIs"
- Drug: "CBT"
- Condition: "response"
- Qualifier: "inadequate"
- Mood: "unable to"
- Procedure: "MRI"